Clinical trial exclusion criterion:
Subjects with a history of significant metabolic, cardiac, congestive heart failure, cerebrovascular, hematological, pulmonary, gastrointestinal, liver, renal, or endocrine disease or cancer that in the investigator's opinion would interfere with or alter the outcome measures, or impact subject safety.

Entity relations:
- Has_qualifier("congestive heart failure", "metabolic")
- Has_qualifier("congestive heart failure", "significant")
- Has_temporal("congestive heart failure", "history")
- OR("metabolic", "cardiac", "cerebrovascular", "hematological", "pulmonary", "gastrointestinal", "liver", "renal", "endocrine")
- OR("congestive heart failure", "cancer", "disease")